Clinical trial inclusion criterion:
TDF to TAF/TAF-containing fixed-dose combination regimens

Annotated entities:
- Drug: "TAF"
- Drug: "TDF"
- Procedure: "TAF-containing fixed-dose combination regimens"